Clinical trial exclusion criterion:
Contraindication to anticoagulation (heparin or warfarin)

Annotated entities:
- Condition: "Contraindication"
- Drug: "anticoagulation"
- Drug: "heparin"
- Drug: "warfarin"